Able to sign informed consent

The above is a clinical trial inclusion criterion. Annotated with entity spans:
[Observation: Able to sign informed consent]